Pregnancy or nursing (negative pregnancy blood test)

The above is a clinical trial exclusion criterion. Annotated with entity spans:
[Condition: Pregnancy] or [Condition: nursing] ([Value: negative] [Measurement: pregnancy blood test])